Describe SPar-K

SPar-K (Signal Partitioning with K-means) is a method to search for archetypical chromatin architectures by partitioning a set of genomic regions characterized by chromatin signal profiles around ChIP-seq peaks and other functional sites.